Clinical trial exclusion criterion:
undergoing elective posterior spine single-level instrumentation surgery

Annotated entities:
- Qualifier: "elective"
- Qualifier: "posterior spine"
- Procedure: "single-level instrumentation surgery"
- Temporal: "undergoing"